Heart attack, stroke, transient ischemic attack or acute congestive heart failure within 4 months

The above is a clinical trial exclusion criterion. Annotated with entity spans:
[Condition: Heart attack], [Condition: stroke], [Condition: transient ischemic attack] or [Condition: acute congestive heart failure] [Temporal: within 4 months]